Known or suspected (or history of) malignancy or chronic illness.

The above is a clinical trial exclusion criterion. Annotated with entity spans:
[Mood: Known] or [Mood: suspected] (or [Temporal: history of]) [Condition: malignancy] or [Condition: chronic illness].